Chronic Kidney Disease (glomerular filtration rate <45 Milliliter per minute).

The above is a clinical trial exclusion criterion. Annotated with entity spans:
[Condition: Chronic Kidney Disease] ([Measurement: glomerular filtration rate] [Value: <45 Milliliter per minute]).